Clinical trial exclusion criterion:
Subjects who have not reached the prescribed period after receiving contraindicated medication or treatment before participation in this clinical trial.

Annotated entities:
- Non-representable: "Subjects who have not reached the prescribed period after receiving contraindicated medication or treatment before participation in this clinical trial."